Clinical trial inclusion criterion:
Negative urine drug screening test at the time of screening

Entity relations:
- Has_value("urine drug screening test", "Negative")